腦中風類型以何種為最常見？
A. 腦出血
B. 蜘蛛膜下腔出血
C. 動靜脈畸型破裂
D. 缺血性腦中風

正確答案：D. 缺血性腦中風